Clinical trial exclusion criterion:
Patients not willing to adhere to study procedures/treatments.

Annotated entities:
- Post-eligibility: "Patients not willing to adhere to study procedures/treatments"